走路途中，左腳底突然踩到圖釘感覺疼痛時，會有下列何種反應？
A. 左大腿和右大腿股二頭肌一起同時收縮
B. 左大腿和右大腿股四頭肌一起同時收縮
C. 左大腿股四頭肌收縮，右大腿股二頭肌收縮
D. 左大腿股二頭肌收縮，右大腿股四頭肌收縮

正確答案：D. 左大腿股二頭肌收縮，右大腿股四頭肌收縮